Participation in other clinical trials that may interfere with this study

The above is a clinical trial exclusion criterion. Annotated with entity spans:
[Non-query-able: Participation in other clinical trials that may interfere with this study]